La modificación diferencial del ARN:
1. Puede dar lugar a múltiples productos a partir de un gen.
2. Se produce gracias a la burbuja de transcripción.
3. Está catalizada por la ARN polimerasa I.
4. Está catalizada por la ARN polimerasa II.
5. Está catalizada por la ARN polimerasa III.

Respuesta correcta: 1. Puede dar lugar a múltiples productos a partir de un gen.